Clinical trial exclusion criterion:
Active bacterial endocarditis within 6 months (180 days) of procedure.

Entity relations:
- Has_temporal("bacterial endocarditis", "Active")
- Has_temporal("bacterial endocarditis", "within 6 months (180 days) of procedure")
- Has_index("within 6 months (180 days) of procedure", "of procedure")